下列何者不與肝血竇（hepatic sinusoids）直接相通？
A. 門小靜脈（portal venule）
B. 中央靜脈（central vein）
C. 葉下靜脈（sublobular vein）
D. 肝小動脈（hepatic arteriole）

正確答案：C. 葉下靜脈（sublobular vein）